What is a HapMap

HapMap is a international effort for creating an annotated haplotype map of the world’s most commonhaplotype sequences.